Clinical trial exclusion criterion:
6. Persistent clinically significant non-hematological toxicity that is Grade >1 by NCI CTCAE v4 from prior chemotherapy

Annotated entities:
- Condition: "toxicity"
- Qualifier: "non-hematological"
- Qualifier: "clinically significant"
- Subjective_judgement: "clinically significant"
- Value: "Grade >1"
- Measurement: "NCI CTCAE v4"
- Qualifier: "Grade >1 by NCI CTCAE v4"
- Procedure: "chemotherapy"
- Temporal: "prior"